Known allergy to skin patch

The above is a clinical trial exclusion criterion. Annotated with entity spans:
Known [Condition: allergy] to [Device: skin patch]